Patients under the age of 18 (Subjects under the age of 18 will not be included in this study due to the continued growth and development of their joints and unstudied effects on children.)

The above is a clinical trial exclusion criterion. Annotated with entity spans:
Patients under the [Person: age] of [Value: 18] [Non-representable: (Subjects under the age of 18 will not be included in this study due to the continued growth and development of their joints and unstudied effects on children.)]